Clinical trial exclusion criterion:
Weight < 800 g;

Entity relations:
- Has_value("Weight", "< 800 g")